Clinical trial exclusion criterion:
recent thrombotic event

Annotated entities:
- Temporal: "recent"
- Condition: "thrombotic event"